Clinical trial exclusion criterion:
Exclusion criteria for MRI: having metal in the body and/or having claustrophobia

Entity relations:
- Subsumes("Exclusion criteria for MRI", "metal in the body")
- OR("metal in the body", "claustrophobia")